Clinical trial exclusion criterion:
Current use of serotonin-precursors (such as L-tryptophan, oxitriptan)

Entity relations:
- Subsumes("serotonin-precursors", "L-tryptophan")
- OR("L-tryptophan", "oxitriptan")